抗癲癇的藥物中，下列何者的作用機轉與阻斷鈉離子管道最不具關連性？
A. phenytoin
B. carbamazepine
C. lamotrigine
D. levetiracetam

正確答案：D. levetiracetam